Clinical trial inclusion criterion:
Type 1 diabetes according to ADA criterias <5 years.

Entity relations:
- Has_qualifier("Type 1 diabetes", "ADA criterias")
- Has_temporal("Type 1 diabetes", "<5 years")